Clinical trial inclusion criteria:
Male and/or female healthy volunteers, age 18 to 55 years. Females must be of non-childbearing potential.
Body Mass Index (BMI) of 17.5 to 30.5 kg/m2; and a total body weight >50 kg (110 lbs).
Subjects who are willing and able to comply with scheduled visits, treatment plan, laboratory tests, diet restrictions and other trial procedures.

Annotated entities:
- Person: "Male"
- Person: "female"
- Condition: "healthy"
- Person: "age"
- Value: "18 to 55 years"
- Person: "Females"
- Condition: "childbearing potential"
- Negation: "non"
- Measurement: "Body Mass Index (BMI)"
- Value: "17.5 to 30.5 kg/m2"
- Measurement: "total body weight"
- Value: ">50 kg (110 lbs)"
- Post-eligibility: "Subjects who are willing and able to comply with scheduled visits, treatment plan, laboratory tests, diet restrictions and other trial procedures."